Clinical trial inclusion criterion:
7. Age ≥18 years.

Annotated entities:
- Parsing_Error: "7."
- Person: "Age"
- Value: "≥18 years"